有關砂眼（trachoma）的病徵，下列何者最具有診斷上的意義？
A. 輪部濾泡（limbal follicles）和Herbert pits
B. 巨型乳頭狀突起（giant papillae）
C. Horner-Trantas dots
D. 結膜結石（lithiasis）

正確答案：A. 輪部濾泡（limbal follicles）和Herbert pits